Being currently at risk for suicide

The above is a clinical trial exclusion criterion. Annotated with entity spans:
Being currently at [Observation: risk for suicide]